major axial deviation (varus >5° , valgus > 5°),

The above is a clinical trial exclusion criterion. Annotated with entity spans:
[Condition: major axial deviation] ([Measurement: varus] [Value: >5°] , [Measurement: valgus] [Value: > 5°]),